What is the function of kisspeptin in the brain?

The function of kisspeptin in the brain is not really known, but it plays an integral role in the regulation of hunger, sex, and reproduction. Kisspeptin is the most potent factor known to induce GnRH release in Mice.  URL_0